Clinical trial exclusion criterion:
2. Subject is pregnant or lactating or is attempting or expecting to become pregnant during the study

Entity relations:
- OR("pregnant", "lactating")